Patients over 18 years old

The above is a clinical trial inclusion criterion. Annotated with entity spans:
Patients [Value: over 18 years] [Person: old]